Which methods have been developed for extracting sequence variants from the literature?

TmVar and nala